Clinical trial exclusion criterion:
Use of anti-coagulant treatment such as heparin, warfarin, platelet inhibitors, thrombin and factor X inhibitors.

Annotated entities:
- Procedure: "anti-coagulant treatment"
- Drug: "heparin"
- Drug: "warfarin"
- Drug: "platelet inhibitors"
- Drug: "thrombin"
- Drug: "factor X inhibitors"